Clinical trial inclusion criterion:
Planned to use patient-controlled intravenous analgesia after surgery;

Annotated entities:
- Qualifier: "patient-controlled"
- Procedure: "intravenous analgesia"
- Temporal: "after surgery"
- Procedure: "surgery"
- Reference_point: "surgery"